Clinical trial inclusion criterion:
free from sleep apnea

Annotated entities:
- Negation: "free from"
- Condition: "sleep apnea"